Concomitant administration of strong inhibitors of P-glycoprotein like ketoconazole, cyclosporin, itraconazole or dronedarone

The above is a clinical trial exclusion criterion. Annotated with entity spans:
Concomitant administration of strong [Drug: inhibitors of P-glycoprotein] like [Drug: ketoconazole], [Drug: cyclosporin], [Drug: itraconazole] or [Drug: dronedarone]